下列那一種抗憂鬱劑造成性功能障礙之副作用最大？
A. Fluoxetine
B. Trazodone
C. Bupropion
D. Moclobemide

正確答案：A. Fluoxetine